Una mujer de 78 años de edad está siendo intervenida para implantarle un marcapasos definitivo por un bloqueo aurículo-ventricular. Entre sus antecedentes personales destacan hipertensión arterial, hipercolesterolemia, diabetes mellitus y obesidad mórbida. El procedimiento es largo y laborioso por la obesidad de la paciente y se realiza mediante infiltraciones con anestésico local. A los cuarenta y cinco minutos del inicio de la intervención comienza a mostrarse agitada y con desorientación progresiva. Refiere que está mareada y que no ve ni oye bien. A la exploración física tiene una discreta midriasis bilateral, tiritonas y temblores distales en las extremidades superiores. ¿Cuál sería la actitud más lógica a seguir ante este cuadro clínico?
1. La sintomatología neurológica orienta a una toxicidad por anestésicos locales. Se debería interrumpir la administración de anestésico local, administrar diacepam o midazolam intravenosos, terminar el procedimiento lo antes posible y poner a la paciente bajo observación clínica.
2. La sintomatología es claramente compatible con un ictus isquémico agudo. Hay que completar el examen neurológico una vez finalizada la implantación del marcapasos e iniciar tratamiento con heparina de bajo peso molecular a una dosis de 0,5 mg por kg y día, tras realizar un TAC urgente.
3. El cuadro clínico es compatible con una crisis de ansiedad provocada por el dolor durante la implantación del marcapasos. El tratamiento correcto incluye una mayor infiltración con el anestésico local para aliviar el dolor y la administración de diacepam intravenoso por sus efectos ansiolíticos.
4. Dados los antecedentes clínicos de la paciente, lo más probable es que esté sufriendo un síndrome coronario agudo. Se debe realizar un electrocardiograma, obtener una determinación de CPK-MB y avisar a Cardiología para iniciar el tratamiento adecuado.
5. Se debe realizar una determinación urgente de glucemia, dado que el cuadro clínico podría corresponder a una cetoacidosis diabética.

Respuesta correcta: 1. La sintomatología neurológica orienta a una toxicidad por anestésicos locales. Se debería interrumpir la administración de anestésico local, administrar diacepam o midazolam intravenosos, terminar el procedimiento lo antes posible y poner a la paciente bajo observación clínica.